Clinical trial inclusion criterion:
Ongoing treatment with analgesics

Entity relations:
- AND("treatment", "analgesics")
- Has_temporal("treatment", "Ongoing")